What eye disease(s) are associated with ocular toxoplasmosis?

Retinochoroiditis is the most frequent manifestation of congenital toxoplasmosis